Mujer de 73 años de edad que ingresa por cuadro de disnea progresiva hasta hacerse de reposo, ortopnea y aumento de 4 kg de peso. En la exploración física se aprecia presión arterial de 150/84 mm Hg, frecuencia cardiaca 100 latidos/minuto, aumento de la presión venosa yugular, crepitantes en ambas bases y edemas maleolares. Tratamiento habitual: enalapril 5 mg cada 12 horas, furosemida 80 mg al día. ¿Cuál es el tratamiento más adecuado en este momento?
1. Administrar furosemida por vía intravenosa.
2. Aumentar dosis de enalapril según tolerancia y administrar furosemida por vía intravenosa.
3. Iniciar un beta-bloqueante.
4. Añadir tratamiento con amlodipino.

Respuesta correcta: 2. Aumentar dosis de enalapril según tolerancia y administrar furosemida por vía intravenosa.